下列何種胰臟內分泌腫瘤會出現皮膚紅斑（skin rash）？
A. insulinoma
B. glucagonoma
C. gastrinoma
D. islet cell tumor

正確答案：B. glucagonoma